Clinical trial inclusion criterion:
Age >= 65 years, < 90 years;

Entity relations:
- Has_value("Age", ">= 65 years, < 90 years")